52歲無過去病史的公務員趙先生，因為深頸部嚴重感染引起	血性休克，他的喉部因膿瘍壓迫而造成呼吸困難，被送到急診時已意識不清，醫師判斷必須立即進行氣管切開及頸部膿瘍引流以搶救生命，下列各項考量何者最適當？
A. 病人無法親自簽	以安排手術，可按壓病人指印替代
B. 因病人無法簽名，需等候家屬到再請家屬代理簽署
C. 緊急狀態，應逕行手術搶救
D. 先了解病人是否曾簽署DNR再做手術與否的決定

正確答案：C. 緊急狀態，應逕行手術搶救